Clinical trial exclusion criterion:
Presence of a skin lesion suspicious for malignancy, unless excised prior to Day 1.

Annotated entities:
- Condition: "skin lesion"
- Qualifier: "suspicious for malignancy"
- Condition: "malignancy"
- Procedure: "excised"
- Temporal: "prior to Day 1"
- Reference_point: "Day 1"